history of allergy to study drugs

The above is a clinical trial exclusion criterion. Annotated with entity spans:
history of [Condition: allergy] to [Drug: study drugs]